Clinical trial inclusion criteria:
Women
= 3 UTIs within the last 12 months or = 2 UTIs within the last 6 months;
Laboratory urine culture: <103 CFUs
Age > 18 years

Annotated entities:
- Person: "Women"
- Condition: "UTIs"
- Multiplier: "= 3"
- Temporal: "within the last 12 months"
- Multiplier: "= 2"
- Condition: "UTIs"
- Temporal: "within the last 6 months"
- Measurement: "Laboratory urine culture"
- Value: "<103 CFUs"
- Person: "Age"
- Value: "> 18 years"